are high level ambulators corresponding to levels E to F of the Special Interest Group of Amputee Medicine (SIGAM) mobility grade

The above is a clinical trial inclusion criterion. Annotated with entity spans:
are [Condition: high level ambulators] corresponding to [Value: levels E to F] of the [Measurement: Special Interest Group of Amputee Medicine (SIGAM) mobility grade]